Clinical trial inclusion criterion:
Positive Anti-Mitochondrial Antibodies (AMA) titers (>1/40 on immunofluorescence or M2 positive by enzyme linked immunosorbent assay (ELISA) or positive PBC-specific antinuclear antibodies

Entity relations:
- Has_value("enzyme linked immunosorbent assay (ELISA)", "M2 positive")
- Has_value("immunofluorescence", ">1/40")
- Has_value("PBC-specific antinuclear antibodies", "positive")
- Subsumes("Positive Anti-Mitochondrial Antibodies (AMA) titers", "immunofluorescence")
- Subsumes("Positive Anti-Mitochondrial Antibodies (AMA) titers", "enzyme linked immunosorbent assay (ELISA)")
- Subsumes("Positive Anti-Mitochondrial Antibodies (AMA) titers", "PBC-specific antinuclear antibodies")